Diagnosed with a medical or psychiatric illness that may interfere with study participation

The above is a clinical trial exclusion criterion. Annotated with entity spans:
Diagnosed with a medical or [Condition: psychiatric illness that may interfere with study participation]